Clinical trial exclusion criterion:
Greater than 12 months from spinal cord injury

Entity relations:
- Has_temporal("spinal cord injury", "Greater than 12 months")